Hombre de 84 años afecto de insuficiencia respiratoria grave secundaria a linfangitis carcinomatosa asociada a cáncer gástrico. Un compañero de su servicio ha iniciado, ese mismo día, tratamiento con morfina oral 10 mg/4 horas. El paciente está inquieto, a 34 respiraciones por minuto, la saturación de O2 es de 80% con una FiO2 de 28%. ¿Cuál debe ser su actitud?
1. Retirar el tratamiento porque puede empeorar la insuficiencia respiratoria.
2. Aumentar las dosis hasta 20 mg/4 horas según evolución.
3. Aumentar el flujo de oxígeno a 35%.
4. Cambiar el tratamiento de morfina por escopolamina.
5. Añadir al tratamiento risperidona.

Respuesta correcta: 2. Aumentar las dosis hasta 20 mg/4 horas según evolución.